Clinical trial exclusion criterion:
Current use of high dose inhaled or systemic steroids

Annotated entities:
- Drug: "steroids"
- Qualifier: "inhaled"
- Qualifier: "systemic"
- Qualifier: "high dose"
- Temporal: "Current"